下列何種方式對弱視的治療較無效？
A. 遮閉（occlusion）療法（遮住好眼）
B. 禁制（penalization）療法（好眼點atropine眼藥水）
C. 屈光配鏡（optical devices）
D. 注射肉毒桿菌素（botulinum toxin）於弱視眼

正確答案：D. 注射肉毒桿菌素（botulinum toxin）於弱視眼